El cáncer de páncreas más frecuente es:
1. El tumor papilar mucinoso intraductal.
2. El carcinoma neuroendocrino de páncreas.
3. El cistoadenocarcinoma de páncreas.
4. El insulinoma maligno.
5. El adenocarcinoma ductal de páncreas.

Respuesta correcta: 5. El adenocarcinoma ductal de páncreas.